一位 42 歲王先生，近半年一直認為世界末日即將來到，而決定賣掉所有財產，去追隨他所信的教主，但家人堅決反對而將他強制送醫並住院治療，他仍堅持自己沒病且對治療不合作，下列敘述何者錯誤？
A. 若與王先生同一宗教的教友也不認同其想法，則比較像宗教妄想
B. 建立有效的醫病關係是成功治療的關鍵
C. 治療目標為降低妄想對病人及家人的影響
D. 妄想症對藥物療效不佳，很難痊癒

正確答案：D. 妄想症對藥物療效不佳，很難痊癒